Clinical trial inclusion criterion:
age > 17 and < 60 years;

Entity relations:
- Has_value("age", "> 17 and < 60 years")